History of atrial fibrillation or muscle disease (myopathy)

The above is a clinical trial exclusion criterion. Annotated with entity spans:
History of [Condition: atrial fibrillation] or [Condition: muscle disease] ([Condition: myopathy])